某一世代型研究法不以暴露組與非暴露組選取研究對象，而以選取一個界定明確的群體為研究對象。此研究取樣方法最大的優點為何？
A. 可以同時研究多個暴露因子
B. 可以降低研究成本
C. 可以較快完成研究工作
D. 可以完全解決干擾因素的影響

正確答案：A. 可以同時研究多個暴露因子